Clinical trial exclusion criteria:
COPD exacerbation, very severe COPD with hypoxemia at low altitude (FEV1/FVC <0.7, FEV1 <40% predicted, oxygen saturation on room air <92% at 750 m).
Comorbidities such as uncontrolled cardiovascular disease, i.e., unstable systemic arterial hypertension, coronary artery disease; previous stroke; OSA; pneumothorax in the last 2 months.
Internal, neurologic, rheumatologic or psychiatric disease including current heavy smoking (>20 cigarettes per day)
Known renal failure or allergy to acetazolamide and other sulfonamides

Annotated entities:
- Condition: "COPD exacerbation"
- Qualifier: "very severe"
- Condition: "COPD"
- Condition: "hypoxemia"
- Qualifier: "low altitude"
- Measurement: "FEV1/FVC"
- Value: "<0.7"
- Measurement: "FEV1"
- Value: "<40% predicted"
- Measurement: "oxygen saturation"
- Qualifier: "room air"
- Value: "<92%"
- Qualifier: "750 m"
- Condition: "cardiovascular disease"
- Qualifier: "uncontrolled"
- Condition: "Comorbidities"
- Qualifier: "unstable"
- Condition: "systemic arterial hypertension"
- Condition: "coronary artery disease"
- Temporal: "previous"
- Condition: "stroke"
- Condition: "OSA"
- Condition: "pneumothorax"
- Temporal: "in the last 2 months"
- Qualifier: "Internal"
- Qualifier: "neurologic"
- Qualifier: "rheumatologic"
- Qualifier: "psychiatric"
- Condition: "disease"
- Temporal: "current"
- Observation: "smoking"
- Qualifier: "heavy"
- Value: ">20"
- Measurement: "cigarettes per day"
- Condition: "renal failure"
- Condition: "allergy"
- Drug: "acetazolamide"
- Drug: "sulfonamides"
- Qualifier: "other"